Clinical trial exclusion criterion:
Patient who is HCV negative has received an HCV positive (HCV RNA by PCR or HCV antibody) donor liver

Entity relations:
- Has_value("HCV", "negative")
- Has_value("HCV", "positive")
- AND("donor", "HCV")
- AND("HCV RNA", "PCR")
- Subsumes("HCV", "HCV RNA")
- Has_qualifier("donor", "liver")
- OR("HCV RNA", "HCV antibody")